Clinical trial exclusion criterion:
Patients on life support or in a critical care unit.

Entity relations:
- AND("life support", "critical care unit")